Clinical trial exclusion criterion:
Uncontrolled hyperlipidemia;

Entity relations:
- Has_qualifier("hyperlipidemia", "Uncontrolled")